下列有關子宮頸癌顯微侵犯（microinvasive）病灶的敘述，何者錯誤？
A. 第一期 a1（stage Ia1）
B. 侵犯深度在 basement membrane 下，大於 7 mm
C. 沒有發現在淋巴或血管的侵犯
D. 治療方法可選擇子宮全切除手術

正確答案：B. 侵犯深度在 basement membrane 下，大於 7 mm